Clinical trial inclusion criterion:
2. Sex: Male and non-pregnant, non-lactating female

Entity relations:
- Has_negation("lactating", "non")
- Has_negation("pregnant", "non")
- AND("female", "pregnant")
- AND("female", "lactating")
- OR("Male", "female")